History of skin disease or hypersensitivity and repeated contact allergies.

The above is a clinical trial exclusion criterion. Annotated with entity spans:
History of [Condition: skin disease] or [Condition: hypersensitivity] and repeated [Condition: contact allergies].